¿Qué determina la estructura tridimensional de una proteína?
1. La cantidad de aminoácidos básicos que hay en la molécula.
2. La secuencia de aminoácidos.
3. El porcentaje de estructura de hélice α.
4. La cantidad de aminoácidos no polares de la proteína.

Respuesta correcta: 2. La secuencia de aminoácidos.